52歲男性病人過去並無高血壓或心臟病，近半年來運動時呼吸困難逐漸加重且有下肢水腫。經檢查肝腎功能正常，給予利尿劑治療，頸靜脈仍有顯	擴張。門診胸部X光顯示心臟並未擴大，身體診察無心雜音，肝臟稍腫大，有腹水及雙側下肢水腫。心導管檢查右心房平均壓力是15mmHg（正常＜8 mmHg），右心房壓力曲線呈現明顯的Y下降波。本病人另外可能出現下列那一種徵狀（sign）？
A. 血壓上升且脈搏壓變寬
B. 呼氣時，頸動脈擴張可能更形顯
C. 少數病例聽診時會有心包敲擊音（pericardial knock），有些會出現｢奇脈｣（paradoxical pulse）
D. 胸部X光片呈現肺鬱血（lung congestion）現象

正確答案：C. 少數病例聽診時會有心包敲擊音（pericardial knock），有些會出現｢奇脈｣（paradoxical pulse）